Clinical trial inclusion criterion:
Hemoglobin level of 7.0 g/dL or greater

Entity relations:
- Has_value("Hemoglobin level", "7.0 g/dL or greater")